Clinical trial exclusion criterion:
Metal containing corpora aliena in the eye or brain.

Annotated entities:
- Device: "corpora aliena in the eye"
- Device: "corpora aliena in the brain"
- Qualifier: "Metal containing"